Clinical trial exclusion criterion:
Subjects who have used any drugs or substances known to inhibit or induce cytochrome (CYP) P450 enzymes and/or P-glycoprotein (P-gp) within 28 days prior to the first dose and throughout the study

Entity relations:
- Has_temporal("drugs known to inhibit cytochrome (CYP) P450 enzymes", "within 28 days prior to the first dose")
- Has_temporal("drugs known to inhibit cytochrome (CYP) P450 enzymes", "throughout the study")
- Has_temporal("drugs known to inhibit P-glycoprotein (P-gp)", "within 28 days prior to the first dose")
- Has_temporal("drugs known to induce P-glycoprotein (P-gp)", "within 28 days prior to the first dose")
- Has_temporal("drugs known to inhibit P-glycoprotein (P-gp)", "throughout the study")
- Has_temporal("drugs known to induce P-glycoprotein (P-gp)", "throughout the study")
- OR("drugs known to inhibit cytochrome (CYP) P450 enzymes", "drugs known to induce cytochrome (CYP) P450 enzymes")